Clinical trial inclusion criterion:
Patients aged from 18 to 65 years old.

Entity relations:
- Has_value("aged", "from 18 to 65 years old")